Clinical trial exclusion criterion:
Allergy to the vaccine compounds, as egg, neomycin and gelatin.

Entity relations:
- Subsumes("vaccine compounds", "egg")
- OR("egg", "neomycin", "gelatin")